La historia clínica informatizada donde se ingresan los datos relativos a las personas a las que atiende y sus cuidados funciona como una base de datos. Usted está realizando la valoración global de Dolores a la que acaba de conocer, y le pregunta su fecha de nacimiento. Señale cómo se denomina el lugar donde ingresa el dato de información “fecha de nacimiento”:
1. Fila.
2. Columna.
3. Campo.
4. Fichero.

Respuesta correcta: 3. Campo.